Clinical trial exclusion criterion:
Past history of claustrophobia.

Annotated entities:
- Condition: "claustrophobia"